Clinical trial inclusion criterion:
Patients undergoing tibial tubercle osteotomy (TTO) with or without medial patello-femoral ligament (MPFL) reconstruction

Annotated entities:
- Temporal: "undergoing"
- Procedure: "tibial tubercle osteotomy (TTO)"
- Procedure: "medial patello-femoral ligament (MPFL) reconstruction"